Clinical trial inclusion criterion:
Phase 1 Specific Patient at least 18yrs of age with histologically confirmed CLL/SLL or B-cell Non-Hodgkin lymphoma (DLBCL, FL, MCL, MZL, lymphoplasmacytic lymphoma).

Annotated entities:
- Condition: "CLL"
- Condition: "SLL"
- Condition: "B-cell Non-Hodgkin lymphoma"
- Condition: "DLBCL"
- Condition: "FL"
- Condition: "MCL"
- Condition: "MZL"
- Condition: "lymphoplasmacytic lymphoma"
- Value: "at least 18yrs"
- Person: "age"
- Procedure: "histologically"
- Value: "confirmed"